Clinical trial inclusion criteria:
Diagnosis of Type 1 diabetes (for at least a year)
On multiple daily insulin injections, including basal long-acting insulin and rapid-acting insulin before each meal.
HbA1c < 75 mmol/mol (9.0%)
Participant and/or parent/legal guardian willing and able to give informed consent for participation in the study.
Family have a freezer in which to safely store the test meals.
In the Investigator's opinion, is able and willing to comply with all trial requirements.

Annotated entities:
- Condition: "Type 1 diabetes"
- Temporal: "at least a year"
- Drug: "insulin"
- Qualifier: "daily"
- Drug: "insulin"
- Drug: "insulin"
- Qualifier: "rapid-acting"
- Qualifier: "basal long-acting"
- Measurement: "HbA1c"
- Value: "< 75 mmol/mol"
- Value: "9.0%"
- Informed_consent: "Participant and/or parent/legal guardian willing and able to give informed consent for participation in the study"
- Non-query-able: "Family have a freezer in which to safely store the test meals"
- Post-eligibility: "In the Investigator's opinion, is able and willing to comply with all trial requirements"